Clinical trial exclusion criterion:
15. In the investigator's opinion, subject has a co-morbid condition(s) that could limit the life expectancy to less than one year, or limit the subject's ability to participate in the study or comply with follow-up requirements or impact the scientific integrity of the study.

Annotated entities:
- Subjective_judgement: "In the investigator's opinion"
- Measurement: "life expectancy"
- Observation: "life expectancy"
- Value: "less than one year"
- Post-eligibility: "In the investigator's opinion, subject has a co-morbid condition(s) that could limit the life expectancy to less than one year, or limit the subject's ability to participate in the study or comply with follow-up requirements or impact the scientific integrity of the study."